Clinical trial inclusion criterion:
3. Residence in AFRH-Washington or the Veterans Home of California-Yountville

Entity relations:
- Has_context("AFRH-Washington", "Residence")
- OR("AFRH-Washington", "Veterans Home of California-Yountville")